Coagulopathies (INR > 2, activated partial thromboplastin time - aPTT>44 sec);

The above is a clinical trial exclusion criterion. Annotated with entity spans:
[Condition: Coagulopathies] ([Measurement: INR] [Value: > 2], [Measurement: activated partial thromboplastin time - aPTT][Value: >44 sec]);